A1C >7.0%

The above is a clinical trial exclusion criterion. Annotated with entity spans:
[Measurement: A1C] [Value: >7.0%]